Clinical trial exclusion criterion:
Subject has participated in any study using an investigational drug or device within 30 days or within 5 half-lives of the investigational drug (whichever is longer) of entry into this study.

Entity relations:
- AND("participated in any study", "investigational drug")
- Has_temporal("participated in any study", "within 5 half-lives of the investigational drug")
- Has_index("within 5 half-lives of the investigational drug", "of the investigational drug")
- Has_index("within 5 half-lives of the investigational drug", "of the investigational drug")
- OR("investigational drug", "device")
- OR("within 5 half-lives of the investigational drug", "of the investigational drug within 30 days")